What is SpatialDE?

Technological advances have made it possible to measure spatially resolved gene expression at high throughput. However, methods to analyze these data are not established. SpatialDE is a statistical test to identify genes with spatial patterns of expression variation from multiplexed imaging or spatial RNA-sequencing data. SpatialDE also implements 'automatic expression histology', a spatial gene-clustering approach that enables expression-based tissue histology.